Patients with a history of hypothyroidism unless taking a stable dose of thyroid medication and asymptomatic or euthyroid for 6 months;

The above is a clinical trial exclusion criterion. Annotated with entity spans:
Patients with a history of [Condition: hypothyroidism] [Negation: unless] taking a stable dose of [Drug: thyroid medication] and asymptomatic or euthyroid for 6 months;